有關藥物作用活性的敘述，下列何者正確？
A. efficacy越大的藥物其potency也越大
B. 若10 mg藥物A與100 mg藥物B的作用程度相同時，藥物A的therapeutic index較藥物B大
C. 作用在同一受體的藥物會因受體組織分布的不同而產生不同的療效與毒性
D. spare receptor是藥物產生毒性的主要原因

正確答案：C. 作用在同一受體的藥物會因受體組織分布的不同而產生不同的療效與毒性